Clinical trial exclusion criterion:
Patients who can not tolerate apatinib treatment as judged by the investigator depending on the their medical history;

Annotated entities:
- Condition: "tolerate"
- Negation: "not"
- Drug: "apatinib"